¿Qué inteligencia implica flexibilidad, capacidad de adaptación y afrontamiento de situaciones nuevas, sin que el aprendizaje previo sea determinante en su manifestación?:
1. La Inteligencia Fluida, Gf.
2. Fundamentalmente, el factor de Inteligencia General, g.
3. La Inteligencia Cristalizada, Gc.
4. La Inteligencia Adaptativa, GAd.

Respuesta correcta: 1. La Inteligencia Fluida, Gf.